Clinical trial exclusion criterion:
History of alcohol or drug dependence in the past year

Entity relations:
- Has_temporal("alcohol dependence", "the past year")
- OR("alcohol dependence", "drug dependence")